下列有關蒲金尼氏纖維（Purkinje fiber）的敘述，何者正確？
A. 是神經纖維
B. 是特化心肌細胞
C. 有橫小管（transverse tubule）
D. 細胞相接觸有閏盤（intercalated disc）

正確答案：B. 是特化心肌細胞